Clinical trial inclusion criterion:
dilated cardiomyopathy due to valvular heart disease, hypertensive heart disease, history of myocarditis (no active myocardial infection present)

Entity relations:
- causal("dilated cardiomyopathy", "valvular heart disease")
- Has_temporal("myocarditis", "history")
- Has_temporal("myocardial infection", "active")
- Has_negation("myocardial infection", "no")
- AND("myocarditis", "myocardial infection")
- OR("dilated cardiomyopathy", "myocarditis", "hypertensive heart disease")